Clinical trial exclusion criterion:
Total bilirubin > 3 mg/dl

Entity relations:
- Has_value("Total bilirubin", "> 3 mg/dl")